previous adverse experience with study drugs

The above is a clinical trial exclusion criterion. Annotated with entity spans:
[Temporal: previous] [Condition: adverse experience] with [Drug: study drugs]